Clinical trial inclusion criterion:
English- or Spanish-speaking parent(s)/legally authorized representative(s) (LAR(s))

Annotated entities:
- Non-query-able: "English- or Spanish-speaking parent(s)/legally authorized representative(s) (LAR(s))"